Fasting blood glucose 100-125 mg/dL

The above is a clinical trial inclusion criterion. Annotated with entity spans:
[Measurement: Fasting blood glucose] [Value: 100-125 mg/dL]